Clinical trial exclusion criterion:
4. Received an investigational drug in the 30 days prior to the screening for this study

Entity relations:
- Has_index("in the 30 days prior to the screening", "the screening")
- Has_temporal("investigational drug", "in the 30 days prior to the screening")